Clinical trial exclusion criterion:
Joint contracture

Annotated entities:
- Condition: "Joint contracture"